一位 60 歲男性病患於一週前因退化性關節炎接受左髖部人工髖關節全置換手術治療（total hip replacement），術後連續五天注射止痛劑和 cephalosporin 治療，病人於術後第 7 天開始發生持續性腹瀉、腹痛、且帶有少許血便，發燒及白血球增多，但並無腹膜炎現象，此時除了 stool culture 之外，該先如何處理？
A. 給予 buscopan，並重新使用 cephalosporin 治療
B. 作 stool cytotoxin assay，保守性治療，並安排大腸鏡檢查
C. 安排 barium enema 檢查
D. 安排緊急全大腸切除術治療

正確答案：B. 作 stool cytotoxin assay，保守性治療，並安排大腸鏡檢查